Contraindication of MRI Claustrophobia Metallic hazards Pacemaker implant eGFR<30 ml/min

The above is a clinical trial exclusion criterion. Annotated with entity spans:
[Condition: Contraindication] of [Procedure: MRI] [Condition: Claustrophobia] [Condition: Metallic hazards] [Device: Pacemaker implant] [Measurement: eGFR][Value: <30 ml/min]